Clinical trial inclusion criteria:
Premenopausal women
18-35 years old
FSH levels < 10 mIU/ml
AFC> 10
Regular cycles
BMI < 28
Signed informed consent

Annotated entities:
- Person: "Premenopausal"
- Person: "women"
- Person: "old"
- Value: "18-35 years"
- Measurement: "FSH levels"
- Value: "< 10 mIU/ml"
- Measurement: "AFC"
- Value: "> 10"
- Condition: "Regular cycles"
- Measurement: "BMI"
- Value: "< 28"
- Informed_consent: "Signed informed consent"